Las enterobacteriaceas:
1. Son bacterias móviles con flagelación polar.
2. Pueden respirar los nitratos.
3. Son catalasa negativas.
4. No incluyen patógenos de vegetales.

Respuesta correcta: 2. Pueden respirar los nitratos.